Clinical trial inclusion criteria:
HBsAg and HBeAg positive for more than 6 months, HBV DNA detectable with ALT level abnormal lasted for three months and at least time190 IU/L or liver puncture biopsy demonstrated apparent inflammation, never treated before enrolled.

Annotated entities:
- Condition: "HBeAg positive"
- Condition: "HBsAg positive"
- Temporal: "for more than 6 months"
- Condition: "HBV DNA detectable"
- Measurement: "ALT level"
- Value: "abnormal"
- Temporal: "lasted for three months"
- Temporal: "at least time"
- Value: "190 IU/L"
- Procedure: "liver puncture biopsy"
- Condition: "inflammation"
- Negation: "never"
- Procedure: "treated"
- Temporal: "before enrolled"
- Reference_point: "enrolled"
- Procedure: "enrolled"